Clinical trial exclusion criterion:
Patients who are pregnant or breast feeding

Annotated entities:
- Pregnancy_considerations: "Patients who are pregnant or breast feeding"